30歲林先生，結婚已一年不孕。在不孕症門診發現精液量很少（< 1 cc），下列何者最不可能為其病因？
A. 射精管阻塞
B. 早洩
C. 逆行性射精
D. 睪固酮低下症

正確答案：B. 早洩